Clinical trial exclusion criterion:
Patients with hypertrophic occlusive myocardiopathy, severe occlusive coronary artery disease, aortic stenosis, hemodynamically significant aortic valve or mitral valve stenosis

Entity relations:
- Has_qualifier("occlusive coronary artery disease", "severe")
- Has_qualifier("aortic valve stenosis", "hemodynamically significant")
- OR("aortic valve stenosis", "mitral valve stenosis")
- OR("hypertrophic occlusive myocardiopathy", "occlusive coronary artery disease", "aortic stenosis", "aortic valve stenosis")